Severe liver or renal disease.

The above is a clinical trial exclusion criterion. Annotated with entity spans:
[Qualifier: Severe] liver or [Condition: renal disease].